Clinical trial inclusion criterion:
Negative urine drug screening test at the time of screening

Annotated entities:
- Measurement: "urine drug screening test"
- Value: "Negative"